Clinical trial exclusion criterion:
Sildenafil (Viagra), tadalafil (Cialis), vardenafil (Levitra), and avanafil (Stendra) will not be permitted during the study drug dose Titration Period, because of increased risk of hypotension in combination with alpha-1 blockers, but will be allowed at half the usual starting dose following the study drug dose Titration Period, per VA prescribing guidelines.

Annotated entities:
- Drug: "Sildenafil"
- Drug: "Viagra"
- Drug: "tadalafil"
- Drug: "Cialis"
- Drug: "vardenafil"
- Drug: "Levitra"
- Drug: "avanafil"
- Drug: "Stendra"
- Temporal: "during the study drug dose Titration Period"